Clinical trial exclusion criterion:
Other neoplastic disease in the 5 previous years, except squamous or basal cell skin carcinoma or cervical "in situ" carcinoma

Annotated entities:
- Condition: "neoplastic disease"
- Qualifier: "Other"
- Temporal: "in the 5 previous years"
- Condition: "basal cell skin carcinoma"
- Condition: "squamous cell skin carcinoma"
- Condition: "cervical "in situ" carcinoma"
- Negation: "except"